Clinical trial exclusion criterion:
Myoma.

Annotated entities:
- Condition: "Myoma"